How are cryptic unstable transcripts (CUTs) defined?

Cryptic unstable transcripts (CUTs) were recently described as a principal class of RNA polymerase II transcripts in Saccharomyces cerevisiae.